有關肝臟移植的適應症，下列何者錯誤？
A. Primary sclerosing cholangitis
B. Failure of a previous liver graft
C. Alagille's syndrome
D. Colon cancer with liver metastases

正確答案：D. Colon cancer with liver metastases